Clinical trial exclusion criterion:
History of Chronic pain or ongoing treatment for chronic pain

Entity relations:
- Has_temporal("treatment", "ongoing")
- AND("treatment", "chronic pain")
- Has_temporal("Chronic pain", "History")
- AND("Chronic pain", "treatment")